美國大法官 Cardozo 早在 20 世紀初就清楚揭示：「每一個心智健全的成年人，都有權利決定其身體要作如何之處置。」此一保障身體自主權的概念，在 1950 年代以後，形成了那一個重要的醫病關係之原則？
A. 病人生病時欠缺作決定的必要心智能力，故醫師有義務為病人作決定
B. 醫師執行醫療行為，應取得病人的「知情同意」（或稱告知後同意）
C. 為了幫助病人作出最好的決定，醫師可以視個案情況，斟酌告知病人其病情
D. 醫師為避免以專業的醫學知識來增加病人負擔，應該說的愈少愈好

正確答案：B. 醫師執行醫療行為，應取得病人的「知情同意」（或稱告知後同意）